Está ausente de los tejidos conjuntivos:
1. Célula calciforme.
2. Adipocito.
3. Mastocito.
4. Linfocito.
5. Eosinófilo.

Respuesta correcta: 1. Célula calciforme.